Decimos que una persona deprimida sufre “anhedonia” cuando:
1. Expresa sentimientos de tristeza.
2. Sufre una disminución de sus emociones positivas y del disfrute vital.
3. Presenta un nivel de actividad disminuido y falta de motivación para realizar actividades.
4. En la depresión se detecta un riesgo de suicidio.

Respuesta correcta: 2. Sufre una disminución de sus emociones positivas y del disfrute vital.